Clinical trial exclusion criterion:
Current use of serotonergic drugs (triptans, certain tricyclic antidepressants, lithium, tramadol, St. John's Wort)

Annotated entities:
- Drug: "serotonergic drugs"
- Drug: "triptans"
- Drug: "tricyclic antidepressant"
- Drug: "lithium"
- Drug: "tramadol"
- Drug: "St. John's Wort"